Clinical trial exclusion criterion:
contraindication to spinal anaesthesia

Entity relations:
- AND("contraindication", "spinal anaesthesia")